Clinical trial inclusion criterion:
Stable coronary artery disease

Entity relations:
- Has_qualifier("coronary artery disease", "Stable")